Clinical trial exclusion criteria:
Pregnant woman or breastfeeding
immunosuppression including AIDS, corticosteroids over 60mg/day
ongoing antibiotic treatment at the day of inclusion
impossibility to obtain a signed consent form.

Annotated entities:
- Condition: "Pregnant"
- Person: "woman"
- Observation: "breastfeeding"
- Condition: "immunosuppression"
- Condition: "AIDS"
- Drug: "corticosteroids"
- Multiplier: "over 60mg/day"
- Procedure: "treatment"
- Drug: "antibiotic"
- Temporal: "at the day of inclusion"
- Reference_point: "day of inclusion"
- Observation: "signed consent form"
- Condition: "impossibility to obtain"